Clinical trial inclusion criterion:
Women of child bearing potential must test negative on standard pregnancy test (urine or serum)

Entity relations:
- Subsumes("standard pregnancy test", "urine")
- Has_value("standard pregnancy test", "negative")
- AND("Women", "standard pregnancy test")
- AND("child bearing potential", "standard pregnancy test")
- OR("urine", "serum")